Need emergency surgery

The above is a clinical trial exclusion criterion. Annotated with entity spans:
[Mood: Need] [Procedure: emergency surgery]